HYPERTENSIVE: history of BP >140/90, 1 or more antihypertensive medications, LV ejection fraction (LVEF) at least 50%, current BP < 160/90

The above is a clinical trial inclusion criterion. Annotated with entity spans:
[Condition: HYPERTENSIVE]: [Temporal: history] of [Measurement: BP] [Value: >140/90], [Multiplier: 1 or more] [Drug: antihypertensive medications], [Measurement: LV ejection fraction (LVEF)] [Value: at least 50%], [Temporal: current] [Measurement: BP] [Value: < 160/90]